Clinical trial exclusion criterion:
Cigarette smoking

Annotated entities:
- Condition: "Cigarette smoking"